Clinical trial exclusion criterion:
Current medication use which interact with either aspirin or atorvastatin

Entity relations:
- Subsumes("interact", "aspirin")
- AND("medication", "interact")
- Has_temporal("medication", "Current")
- OR("aspirin", "atorvastatin")